Clinical trial inclusion criterion:
Normal liver function (defined as aspartate aminotransferase 10-40 U/L and alanine aminotransferase 7-56 U/L)

Entity relations:
- Has_value("alanine aminotransferase", "7-56 U/L")
- Has_value("aspartate aminotransferase", "10-40 U/L")
- Subsumes("Normal liver function", "aspartate aminotransferase")
- Subsumes("Normal liver function", "alanine aminotransferase")